60歲的男性，被診斷腰椎有腫瘤轉移，其脊椎X光顯示在第一、二、四腰椎有椎體塌陷及成骨性影像（osteoblastic image）。依據脊椎X光結果判斷，最有可能是從下列何者轉移到腰椎？
A. 大腸癌（colon cancer）
B. 胃癌（gastric cancer）
C. 肝癌（hepatic cell carcinoma）
D. 攝護腺癌（prostate cancer）

正確答案：D. 攝護腺癌（prostate cancer）